Chronic hypertension receiving antihypertensive treatment

The above is a clinical trial exclusion criterion. Annotated with entity spans:
[Condition: Chronic hypertension] receiving [Procedure: antihypertensive treatment]